HIV positivity

The above is a clinical trial exclusion criterion. Annotated with entity spans:
[Condition: HIV positivity]